對於 B 型、T 型細胞的抗原受體（antigen receptor），下列那一種敘述正確？
A. 抗原受體的基因在胚原型（germline）時，蛋白質可被表現
B. 遭遇抗原刺激前，抗原受體已呈現於細胞膜上
C. 抗原受體接受刺激後，本身單獨即可傳遞訊息使細胞活化
D. 細胞活化後，其抗原受體皆可被分泌到細胞外

正確答案：B. 遭遇抗原刺激前，抗原受體已呈現於細胞膜上